體重過重的病患，若要每周減重半公斤，每天平均約須減多少熱量？
A. 100 大卡
B. 250 大卡
C. 500 大卡
D. 1000 大卡

正確答案：C. 500 大卡